30歲G0P0的女性，因為結婚三年皆沒有避孕，和丈夫想進行不孕症諮詢。自從11歲初經之後，月經皆規則 28天一次，每次經期持續5天且沒有經痛。抽血檢查及輸卵管攝影（hysterosalpingography）結果皆正常， 量測的antral follicle count為10。丈夫的精液分析（semen analysis）結果為：semen volume 3 ml，sperm concentration 11,000,000/ml，total motility 38%，normal forms 6%。建議他們優先接受那一種醫療輔助生殖（assisted reproductive technologies）最為合理？
A. 試管嬰兒（in vitro fertilization）
B. 卵子捐贈
C. 人工授精（intrauterine insemination）
D. clomiphene citrate

正確答案：C. 人工授精（intrauterine insemination）